Clinical trial exclusion criterion:
Patient is hemodynamically unstable on POD 15

Annotated entities:
- Condition: "hemodynamically unstable"
- Measurement: "POD 15"